Clinical trial inclusion criterion:
Living in the area throughout the duration of the study

Annotated entities:
- Observation: "Living in the area"
- Temporal: "throughout the duration of the study"
- Reference_point: "the study"